Patients over the age of 18 years who are able to give their informed consent

The above is a clinical trial inclusion criterion. Annotated with entity spans:
Patients [Person: over the age of 18 years] who are [Observation: able to give their informed consent]